Clinical trial inclusion criterion:
3. Designated venous leg ulcer meets the following criteria at both the screening and baseline visits. If the patient has multiple ulcers, at least one ulcer must meet the following criteria at both the screening and baseline visits:

Entity relations:
- Has_multiplier("ulcers", "multiple")
- Has_multiplier("ulcer", "at least one")